下列何者不是胃癌（gastric carcinoma）的致病因子？
A. 高脂肪與蛋白質攝取（high fat or protein consumption）
B. 慢性萎縮性胃炎（chronic atrophic gastritis）
C. 腺瘤息肉（adenomatous polyp）
D. 以前接受過胃部分切除術（prior partial gastrectomy）

正確答案：A. 高脂肪與蛋白質攝取（high fat or protein consumption）